aged = 8 months

The above is a clinical trial inclusion criterion. Annotated with entity spans:
[Person: aged] [Value: = 8 months]